Pre-existing hemoptysis of a severity > grade 3 by NCI CTCAE criteria within 4 weeks prior to study entry

The above is a clinical trial exclusion criterion. Annotated with entity spans:
Pre-existing [Condition: hemoptysis] of a [Qualifier: severity] [Value: > grade 3] by [Measurement: NCI CTCAE criteria] [Temporal: within 4 weeks prior to study entry]